Clinical trial inclusion criterion:
Expected survival = 3 months

Annotated entities:
- Observation: "Expected survival"
- Value: "= 3 months"